Clinical trial exclusion criterion:
Insulin dependent Diabetes Mellitus

Entity relations:
- multi("Insulin dependent", "Insulin")
- Has_qualifier("Diabetes Mellitus", "Insulin dependent")